造成減重手術 Roux-en-Y gastric bypass 術後死亡（mortality）的原因，下列敘述何者錯誤？
A. 術後30天的死亡率約 0.3%～0.5%
B. 女性病人也是危險因子（risk factor）之一
C. 肺動脈栓塞是常見的因子之一
D. 心臟病變（cardiac event）是常見因子之一

正確答案：B. 女性病人也是危險因子（risk factor）之一